2. Enhanced risk from lumbar puncture, including documented or suspected cerebral mass lesion predisposing to brain herniation or bleeding diathesis.

The above is a clinical trial exclusion criterion. Annotated with entity spans:
2. [Mood: Enhanced risk] from [Procedure: lumbar puncture], including [Mood: documented] or [Mood: suspected] [Condition: cerebral mass lesion] [Qualifier: predisposing to brain herniation or bleeding diathesis].